Ischemic stroke (determined using the Questionnaire for Verifying Stroke-Free Status (QVSFS)

The above is a clinical trial exclusion criterion. Annotated with entity spans:
[Condition: Ischemic stroke] (determined using the [Qualifier: Questionnaire for Verifying Stroke-Free Status (QVSFS)]